Clinical trial inclusion criterion:
Age >=19 patients who complained of dizziness

Entity relations:
- Has_value("Age", ">=19")